Clinical trial exclusion criterion:
Hemidiaphragmatic dysfunction, suspected or known PNP

Entity relations:
- Has_qualifier("PNP", "suspected")
- OR("suspected", "known")
- OR("Hemidiaphragmatic dysfunction", "PNP")